Clinical trial exclusion criterion:
A significant history of drug/solvent abuse within 5 years of screening or a positive test for drugs of abuse test at screening or on Day -1.

Entity relations:
- Has_index("within 5 years of screening", "screening")
- Has_temporal("drug/solvent abuse", "within 5 years of screening")
- Has_temporal("drug/solvent abuse", "history")
- Has_value("drugs of abuse test", "positive")
- Has_index("at screening", "screening")
- Has_temporal("drugs of abuse test", "at screening")
- OR("drug/solvent abuse", "drugs of abuse test")